Conversion to laparotomy

The above is a clinical trial exclusion criterion. Annotated with entity spans:
[Observation: Conversion to] [Procedure: laparotomy]